Clinical trial exclusion criterion:
Lack of appetite that results in significant unintentional weight loss as determined by the study physician in the last three months

Entity relations:
- Has_qualifier("unintentional weight loss", "significant")
- AND("Lack of appetite", "unintentional weight loss")
- Has_temporal("Lack of appetite", "in the last three months")
- Has_qualifier("unintentional weight loss", "as determined by the study physician")